Which cloud-based platform has been developed for comparing GWAS?

EasyGWAS is a cloud-based platform for comparing the results of Genome-Wide Association Studies (GWAS).